Clinical trial inclusion criterion:
severe concurrent disease,

Annotated entities:
- Qualifier: "severe"
- Temporal: "concurrent"
- Condition: "disease"